Clinical trial exclusion criterion:
Renal failure, moderate or severe renal impairment (estimated glomerular filtration rate < 30 mL/min/1.73 m2), or ongoing dialysis

Annotated entities:
- Condition: "Renal failure"
- Qualifier: "moderate"
- Qualifier: "severe"
- Condition: "renal impairment"
- Measurement: "estimated glomerular filtration rate"
- Value: "< 30 mL/min/1.73 m2"
- Temporal: "ongoing"
- Procedure: "dialysis"